於第二或是第三孕期的胎兒觀察到有囊狀水瘤（cystic hygroma）時，應懷疑最可能與下列何種染色體異常有相關性？
A. triploidy
B. trisomy 18
C. trisomy 21
D. monosomy

正確答案：D. monosomy